life expectancy less than 2 years;

The above is a clinical trial exclusion criterion. Annotated with entity spans:
[Observation: life expectancy] [Value: less than 2 years];